Clinical trial exclusion criterion:
drug or alcohol abuse

Annotated entities:
- Drug: "drug abuse"
- Drug: "alcohol abuse"